Clinical trial exclusion criterion:
Soft drusen in treated eye or fellow eye, signs of choroidal neovascularization on ophthalmoscopy and/or FA/ICGA of the study eye.

Entity relations:
- Has_qualifier("Soft drusen", "treated eye")
- AND("ophthalmoscopy", "choroidal neovascularization")
- Has_qualifier("ophthalmoscopy", "study eye")
- OR("treated eye", "fellow eye")
- OR("ophthalmoscopy", "FA", "ICGA")
- OR("Soft drusen", "ophthalmoscopy")